Clinical trial exclusion criterion:
Suspected, or known addiction to or abuse of illicit drug(s), prescription medicine(s), or alcohol within the past 2 years.

Annotated entities:
- Condition: "abuse"
- Condition: "addiction"
- Qualifier: "prescription medicine"
- Qualifier: "alcohol"
- Qualifier: "illicit drug"
- Temporal: "past 2 years"